Clinical trial exclusion criterion:
Unable to comprehend consent material because of language barrier or psychological difficulty

Annotated entities:
- Post-eligibility: "Unable to comprehend consent material because of language barrier or psychological difficulty"